Clinical trial exclusion criterion:
Any other condition that in the opinion of the Investigator would interfere with the evaluation of the study results or constitute a health hazard for the patient

Annotated entities:
- Post-eligibility: "Any other condition that in the opinion of the Investigator would interfere with the evaluation of the study results or constitute a health hazard for the patient"